Clinical trial exclusion criterion:
Patients with symptomatic orthostatic hypertension (the difference in the blood pressures between measured at supine position and measured at standing position is = 20 mmHg for siSBP and = 10 mmHg for siDBP)

Annotated entities:
- Condition: "orthostatic hypertension"
- Qualifier: "symptomatic"
- Measurement: "difference in the blood pressures"
- Qualifier: "measured at supine position and measured at standing position"
- Value: "= 20 mmHg"
- Value: "= 10 mmHg"
- Measurement: "siDBP"
- Measurement: "siSBP"